19. Use of a platelet-derived growth factor within 28 days before screening

The above is a clinical trial exclusion criterion. Annotated with entity spans:
[Parsing_Error: 19.] Use of a [Drug: platelet-derived growth factor] [Temporal: within 28 days before screening]